Clinical trial exclusion criterion:
Participation in a study with an Investigational Medicinal Product (IMP) other than IgPro20 within three months prior to enrollment.

Annotated entities:
- Non-query-able: "Participation in a study with an Investigational Medicinal Product (IMP) other than IgPro20 within three months prior to enrollment."